Known or suspected serious spinal pathology and spinal implants

The above is a clinical trial exclusion criterion. Annotated with entity spans:
[Mood: Known or suspected] [Qualifier: serious] [Condition: spinal pathology] and [Device: spinal implants]